What is caused by heterozygous lamin B1 and lamin B2 variants?

Microcephaly is a rare autosomal recessive disorder caused by heterozygous lamin B1 and Lamin B2 variants.